Qb-score 1.3 or higher on at least one of the weighted summary parameters QbActivity, QbInattention or QbImpulsivity on the QbTest.

The above is a clinical trial inclusion criterion. Annotated with entity spans:
[Measurement: Qb-score] [Value: 1.3 or higher] on at least one of the weighted summary parameters QbActivity, QbInattention or QbImpulsivity on the QbTest.